Clinical trial inclusion criterion:
Oxygen saturation < 90%

Annotated entities:
- Measurement: "Oxygen saturation"
- Value: "< 90%"